一位 80 歲男性腎組織在顯微鏡下出現廣泛的小血管增厚並發生玻璃樣變性（hyaline change），下列疾病中，何者最常造成這種病理變化？
A. Prolonged systemic hypertension
B. Membranous glomerulonephritis
C. Renal cell carcinoma
D. Acute pyelonephritis

正確答案：A. Prolonged systemic hypertension